3. Known cirrhosis, or >6 standard alcoholic drinks/day

The above is a clinical trial exclusion criterion. Annotated with entity spans:
[Parsing_Error: 3.] Known [Condition: cirrhosis], or [Condition: >6 standard alcoholic drinks/day]